Measurable or non-measurable disease by Response Evaluation Criteria in Solid Tumor (RECIST) 1.1 will be allowed

The above is a clinical trial inclusion criterion. Annotated with entity spans:
Measurable or non-measurable disease by [Measurement: Response Evaluation Criteria in Solid Tumor] ([Measurement: RECIST]) [Value: 1.1] will be allowed